Clinical trial inclusion criteria:
For both groups:
Patients aged from 18 to 65 years old.
Both genders eligible for study.
Female participants must use a contraceptive method.
Feasibility of patch testing.
Participants must be able to understand and sign the Informed Consent, and comply with all aspects of the protocol.
Patients must be registered in a social security system or with a health insurance coverage
 First group: allergic patients
Patients with allergic contact dermatitis to para-phenylenediamine (PPD) based on a history of PPD contact dermatitis and positive PPD patch tests.
 Second group : healthy volunteers
No history of PPD allergic contact dermatitis, with a negative PPD patch test.

Annotated entities:
- Person: "aged"
- Value: "from 18 to 65 years old"
- Person: "Both genders"
- Person: "Female"
- Procedure: "contraceptive method"
- Mood: "Feasibility of"
- Post-eligibility: "patch testing"
- Mood: "be able to"
- Informed_consent: "understand and sign the Informed Consent"
- Informed_consent: "comply with all aspects of the protocol"
- Observation: "registered in a social security system"
- Observation: "health insurance coverage"
- Non-query-able: "health insurance coverage"
- Non-query-able: "registered in a social security system"
- Condition: "allergic"
- Condition: "allergic contact dermatitis"
- Drug: "para-phenylenediamine (PPD)"
- Condition: "contact dermatitis"
- Drug: "PPD"
- Measurement: "PPD patch tests"
- Value: "positive"
- Observation: "healthy"
- Condition: "allergic contact dermatitis"
- Drug: "PPD"
- Negation: "No"
- Measurement: "PPD patch test"
- Value: "negative"